Age 18 or older with unilateral or bilateral inguinal herna for laparoscopic repair

The above is a clinical trial inclusion criterion. Annotated with entity spans:
[Person: Age] [Value: 18 or older] with [Qualifier: unilateral] or [Qualifier: bilateral] [Condition: inguinal herna] [Qualifier: for laparoscopic repair]